下列關於大腸激躁症（irritable bowel syndrome）的敘述，何者正確？
A. 嚴重大腸激躁症，與腸道生理的相關性較強，與精神方面的異常關聯性較小
B. 大腸激躁症的盛行率男性為女性的2～3倍
C. 某些抗生素如rifaximin對於部分大腸激躁症病患會有效
D. 抗憂鬱藥物（antidepressant drugs）對於大腸激躁症是無幫助的

正確答案：C. 某些抗生素如rifaximin對於部分大腸激躁症病患會有效